Clinical trial inclusion criterion:
Men and women between ages >=18 and 65.

Annotated entities:
- Person: "Men"
- Person: "women"
- Parsing_Error: "and"
- Person: "ages"
- Value: "between 18 and 65"
- Parsing_Error: ">="